Clinical trial exclusion criterion:
Bleeding tendency or coagulopathy

Annotated entities:
- Condition: "Bleeding tendency"
- Condition: "coagulopathy"